50歲的B型肝炎男性病人，肝臟內有一顆8公分的肝細胞癌併有肝門靜脈主幹腫瘤栓塞（main portal vein tumor thrombosis），及多處肺部轉移。病人沒有肝硬化，肝臟沒有任何失代償現象，沒有黃疸，沒有腹 水。以下那一種治療最適合這位病人？
A. 肝臟移植
B. 手術切除
C. 無線射頻燒灼術（radiofrequency ablation）
D. 標靶治療（sorafenib）

正確答案：D. 標靶治療（sorafenib）